Clinical trial exclusion criterion:
Patients with a history of, or at imminent risk for, colectomy; who required gastrointestinal surgery within 2 months before screening;

Entity relations:
- Has_temporal("gastrointestinal surgery", "within 2 months before screening")
- Has_temporal("colectomy", "history of")
- OR("history of", "imminent risk for")